Emergency surgeries

The above is a clinical trial exclusion criterion. Annotated with entity spans:
[Procedure: Emergency surgeries]